Which proteins are controlling sterol metabolism in S. cerevisiae?

Sterol metabolism and ERG2 gene regulation in the yeast Saccharomyces cerevisiae. Upc2p, a transcription factor of the zinc cluster family, is an important regulator of sterol biosynthesis and azole drug resistance in Candida albicans. The yeast genome encodes seven oxysterol binding protein homologs, Osh1p-Osh7p, which have been implicated in regulating intracellular lipid and vesicular transport. Northern blot analysis showed that increased binding correlates with increased expression for the analyzed Upc2p targets . Taken together, our results indicate that Upc2p is a key regulator of ergosterol metabolism.